¿Cuál de los compuestos siguientes proporciona átomos de nitrógeno a los anillos de purina y pirimidina?
1. Aspartato.
2. Carbamoil fosfato.
3. Dióxido de carbono.
4. Glutamina.
5. Tetrahidrofolato.

Respuesta correcta: 1. Aspartato.